Clinical trial inclusion criterion:
Patient has an IPSS score of at least 13 at baseline

Annotated entities:
- Measurement: "IPSS score"
- Value: "at least 13"
- Temporal: "at baseline"
- Reference_point: "baseline"